Clinical trial exclusion criterion:
Other active inflammatory process (major infection, malignancy, rheumatoid arthritis/autoimmune disorder) within the prior 28 days.

Entity relations:
- Has_qualifier("active inflammatory process", "Other")
- Subsumes("active inflammatory process", "major infection")
- Has_temporal("active inflammatory process", "within the prior 28 days")
- OR("major infection", "rheumatoid arthritis", "malignancy", "autoimmune disorder")